Clinical trial exclusion criterion:
Confirmed allergy to apatinin and or its excipients;

Annotated entities:
- Condition: "allergy"
- Drug: "apatinin"
- Drug: "excipients"